Rachmilewitz Index is used for which diseases?

Rachmilewitz Index is used for assessment of endoscopic disease activity of patients with ulcerative colitis.